Clinical trial exclusion criterion:
History of head injury or stroke,

Annotated entities:
- Condition: "head injury"
- Condition: "stroke"
- Temporal: "History"